Clinical trial inclusion criterion:
Ages 18-80

Annotated entities:
- Person: "Ages"
- Value: "18-80"